Diagnosed by preoperative imaging modalities to have a brain tumor (including metastatic brain tumors) or vascular lesions (aneurysm, arteriovenous malformation or arteriovenous fistula) requiring surgical intervention.

The above is a clinical trial inclusion criterion. Annotated with entity spans:
Diagnosed by [Temporal: preoperative] [Procedure: imaging modalities] to have a [Condition: brain tumor] (including [Condition: metastatic brain tumors]) or [Condition: vascular lesions] ([Condition: aneurysm], [Condition: arteriovenous malformation] or [Condition: arteriovenous fistula]) requiring [Procedure: surgical intervention].